En fibras musculares lisas:
1. La unidad funcional es el sarcómero.
2. La contracción está regulada por troponina.
3. El sistema autónomo siempre inerva todas las fibras.
4. No se forman puentes cruzados actinamiosina.
5. Puede haber receptores a hormonas.

Respuesta correcta: 5. Puede haber receptores a hormonas.